Clinical trial inclusion criterion:
Age from 40 to 80 years old, either gender;

Annotated entities:
- Person: "Age"
- Value: "from 40 to 80 years old"